有關腹部腔室症候群（abdominal compartment syndrome）之敘述，下列何者錯誤？
A. 為腹壓上升導致多發器官機能受影響的狀態，一般腹腔手術打開時能緩解
B. 膀胱內壓力在35 mmHg以上時，需要積極減壓，否則會有機能受損的可能
C. 太晚減壓，死亡率可能高達七成
D. 腹腔壓力的表現可由下腔靜脈壓力來表示最為準確

正確答案：D. 腹腔壓力的表現可由下腔靜脈壓力來表示最為準確